¿Cuál de las siguientes afirmaciones relativas al tabaco es FALSA?:
1. La principal causa de muerte relacionada con el tabaco son las neoplasias malignas.
2. En promedio, uno de cada tres fumadores morirá de forma prematura como consecuencia del tabaco.
3. El tabaco aumenta el riesgo de cáncer de vejiga.
4. Los que suspenden el tabaquismo tienen una tasa de mortalidad por cáncer de pulmón casi del 50% menor a los 10 años que los sujetos que continúan el consumo.

Respuesta correcta: 1. La principal causa de muerte relacionada con el tabaco son las neoplasias malignas.